Clinical trial exclusion criterion:
Patients with medical conditions that require chronic systemic corticosteroid therapy or require any other form of immunosuppressive medication. However, patients using physiologic replacement doses of hydrocortisone, or its equivalent, will be considered eligible for this study: up to 20 mg hydrocortisone (or 5 mg of prednisone) in the morning and 10 mg hydrocortisone (or 2.5 mg prednisone) in the evening.

Entity relations:
- Has_temporal("systemic corticosteroid therapy", "chronic")
- AND("require immunosuppressive medication", "immunosuppressive medication")
- AND("require chronic systemic corticosteroid therapy", "systemic corticosteroid therapy")
- Has_qualifier("medical conditions", "require chronic systemic corticosteroid therapy")
- Has_multiplier("hydrocortisone", "physiologic replacement doses")
- Has_multiplier("hydrocortisone", "up to 20 mg")
- Has_multiplier("prednisone", "5 mg")
- Has_multiplier("hydrocortisone", "10 mg")
- Has_multiplier("prednisone", "2.5 mg")
- Has_multiplier("hydrocortisone", "in the evening")
- Has_multiplier("hydrocortisone", "in the morning")
- Subsumes("hydrocortisone", "hydrocortisone")
- OR("require chronic systemic corticosteroid therapy", "require immunosuppressive medication")
- OR("hydrocortisone", "prednisone")
- OR("hydrocortisone", "prednisone")